Clinical trial inclusion criterion:
Infection with Plasmodium falciparum or P. vivax either alone or mixed

Annotated entities:
- Condition: "Infection"
- Qualifier: "Plasmodium falciparum"
- Qualifier: "P. vivax"